Clinical trial exclusion criterion:
Any active respiratory, cardiovascular or other disease requiring regular treatment or being otherwise relevant for tolerance of hypoxia or altitude exposure.

Annotated entities:
- Qualifier: "other"
- Condition: "disease"
- Condition: "cardiovascular disease"
- Condition: "respiratory disease"
- Qualifier: "active"
- Mood: "requiring"
- Procedure: "treatment"
- Mood: "relevant being"
- Condition: "tolerance"
- Condition: "hypoxia"
- Condition: "altitude exposure"